Clinical trial inclusion criterion:
Paediatric subjects aged =28 days (= 1 month) to <18 years, requiring non-emergent open hepatic, abdominal, retroperitoneal, pelvic or thoracic (non-cardiac) surgical procedures. i) The first 36 subjects to be enrolled will be subjects aged =1 years to <18 years. ii) The next 4 subjects to be enrolled will be subjects aged =28 days to <1 year.

Entity relations:
- Has_value("aged", "=28 days (= 1 month) to <18 years")
- Has_qualifier("surgical procedures", "hepatic")
- Has_qualifier("surgical procedures", "open")
- Has_qualifier("surgical procedures", "non-emergent")
- OR("hepatic", "abdominal", "retroperitoneal", "pelvic", "thoracic", "non-cardiac")